下列何種細胞激素同時具有發炎和抗發炎的效果？
A. 腫瘤壞死因子-α（TNF-α）
B. 介白質-1（IL-1）
C. 介白質-6（IL-6）
D. 介白質-8（IL-8）

正確答案：C. 介白質-6（IL-6）